下列何者為主動脈氣球幫浦（intra-aortic balloon pump）的最佳使用時機？
A. 急性升主動脈剝離合併急性重度主動脈瓣逆流
B. 升主動脈瘤合併慢性重度主動脈瓣逆流
C. 二尖瓣腱索斷裂合併急性重度二尖瓣逆流
D. 感染性腹主動脈瘤合併	血性休克

正確答案：C. 二尖瓣腱索斷裂合併急性重度二尖瓣逆流